Clinical trial inclusion criterion:
Chronic Heart failure subjects with medical history of cardiac disease or other related cardiovascular disease.

Entity relations:
- Has_qualifier("cardiovascular disease", "related")
- AND("Chronic Heart failure", "cardiac disease")
- OR("cardiac disease", "cardiovascular disease")